Clinical trial inclusion criteria:
planned elective cholecystectomy

Annotated entities:
- Mood: "planned"
- Qualifier: "elective"
- Condition: "cholecystectomy"